與過敏性氣喘好發率有關的衛生假說（hygiene hypothesis），下列那一項敘述最正確？
A. 遺傳因子與發病與否最相關
B. 飲食與發病與否最相關
C. 嬰幼兒時期遭受病毒或是細菌感染，可降低發病率
D. 生長在已開發國家比起未開發國家，發病率往往較低

正確答案：C. 嬰幼兒時期遭受病毒或是細菌感染，可降低發病率